Se acerca a valorar a un recién nacido de 28 semanas de edad gestacional y observa que presenta taquicardia, piel grisácea, llanto difícil de calmar, dedos de las manos y piernas extendidas. Estos síntomas son característicos de que diagnóstico de enfermería:
1. Apnea.
2. Dolor crónico.
3. Conducta desorganizada del lactante.
4. Ansiedad.

Respuesta correcta: 3. Conducta desorganizada del lactante.